Clinical trial exclusion criterion:
Patients with any inflammatory diseases requiring chronic anti-inflammatory therapy

Entity relations:
- multi("anti-inflammatory therapy", "anti-inflammatory therapy")
- Has_qualifier("anti-inflammatory therapy", "chronic")
- AND("inflammatory diseases", "anti-inflammatory therapy")